Irritable Bowel Syndrome (IBS) (ROME III criteria): subtype with diarrhea or mixed form

The above is a clinical trial inclusion criterion. Annotated with entity spans:
[Condition: Irritable Bowel Syndrome (IBS)] ([Qualifier: ROME III criteria]): subtype with [Condition: diarrhea] or [Qualifier: mixed form]